Hematopoietic cell transplantation within 4 weeks of first dose of 852A

The above is a clinical trial exclusion criterion. Annotated with entity spans:
[Procedure: Hematopoietic cell transplantation] [Temporal: within 4 weeks of first dose] of [Drug: 852A]